Clinical trial inclusion criterion:
An expected survival of = 3 months;

Entity relations:
- Has_value("expected survival", "= 3 months")